Age equal or superior to 18 years;

The above is a clinical trial inclusion criterion. Annotated with entity spans:
[Person: Age] [Value: equal or superior to 18 years];